Clinical trial exclusion criterion:
Contraindication to sitagliptin or metformin or thiazolidinedione

Entity relations:
- AND("Contraindication", "sitagliptin")
- OR("sitagliptin", "thiazolidinedione", "metformin")